Clinical trial inclusion criteria:
Patients receiving once daily dosing of methylprednisolone or prednisone in a dose of 10 mg/day or greater
Hyperglycemic (Glucose level > 126 mg/dL)
Diabetic and nondiabetic patients
Expected duration of hospital stay and time on steroids >= 3 days
Patient of appropriate caregiver able to give Informed Consent

Annotated entities:
- Multiplier: "once daily"
- Drug: "methylprednisolone"
- Drug: "prednisone"
- Multiplier: "10 mg/day or greater"
- Condition: "Hyperglycemic"
- Measurement: "Glucose level"
- Value: "> 126 mg/dL"
- Condition: "nondiabetic"
- Condition: "Diabetic"
- Measurement: "Expected duration of hospital stay"
- Measurement: "time on steroids"
- Value: ">= 3 days"
- Informed_consent: "Patient of appropriate caregiver able to give Informed Consent"